Clinical trial exclusion criterion:
chronic lower urinary tract infections (but not simple asymptomatic bacteriuria)

Annotated entities:
- Condition: "lower urinary tract infections"
- Qualifier: "chronic"
- Negation: "not"
- Condition: "asymptomatic bacteriuria"